一位 28 歲年輕男性，主訴前一天開始尿道有多量的黃綠色分泌物，同時解小便時會痛、有灼熱感。他承認在一週前曾有不潔的性接觸。初步臆斷懷疑是淋病性尿道炎；下列檢查何者能夠提供最快速的診斷，以便對症治療？
A. 尿道分泌物的抹片，染色後在 100 倍油鏡下觀察白血球內有無淋病雙球菌
B. 尿道分泌物的細菌培養
C. 尿液細菌培養
D. 尿液常規檢查

正確答案：A. 尿道分泌物的抹片，染色後在 100 倍油鏡下觀察白血球內有無淋病雙球菌